¿En cuál de las siguientes presentaciones fetales estaría indicada siempre la realización de cesárea?
1. Occipito iliaca transversa.
2. Nalgas completas.
3. Mento posterior.
4. Una cesárea anterior.

Respuesta correcta: 3. Mento posterior.